Clinical trial exclusion criterion:
concomitant massage

Annotated entities:
- Procedure: "massage"
- Temporal: "concomitant"